patients classified with American Society of Anesthesiologists Physical Status Classification System as 1 or 2 status

The above is a clinical trial inclusion criterion. Annotated with entity spans:
patients classified with American Society of Anesthesiologists Physical Status Classification System as [Value: 1 or 2] [Measurement: status]